下列何者是最常見之脊椎硬脊膜上轉移（spinal epidural metastasis）初期症狀？
A. 神經根病變（radiculopathy）
B. 局部疼痛（local pain）
C. 尿液滯留（urinary retension）
D. 下肢麻木（numbness of lower limbs）

正確答案：B. 局部疼痛（local pain）